Elige de entre las siguientes frases la que más adecuadamente defina una reacción concertada:
1. Reacción en una sola etapa en la que todos los enlaces que se forman y se rompen lo hacen al mismo tiempo.
2. Reacción en varias etapas en la que todos los enlaces que se forman y se rompen lo hacen al mismo tiempo en la etapa más lenta.
3. Reacción en la que la velocidad de todas las etapas es idéntica.
4. Es una reacción en equilibrio en la que K=1.
5. Reacción en varias etapas en la que todos los enlaces que se forman y se rompen lo hacen al mismo tiempo en la etapa más rápida.

Respuesta correcta: 1. Reacción en una sola etapa en la que todos los enlaces que se forman y se rompen lo hacen al mismo tiempo.